Clinical trial exclusion criterion:
22. Absolute neutrophil count <1500 mm3.

Entity relations:
- Has_value("Absolute neutrophil count", "<1500 mm3")